Clinical trial exclusion criterion:
Subjects with a history of asthma exacerbation requiring the use of systemic corticosteroids (tablets, suspension, or injection) for at least 3 days or a depot corticosteroid injection or emergency room attendance (within 3 months) or requiring hospitalization for asthma (within 6 months) prior to screening.

Entity relations:
- Has_temporal("emergency room attendance", "within 3 months")
- AND("hospitalization", "asthma")
- Has_temporal("hospitalization", "within 6 months")
- Has_temporal("systemic corticosteroids", "for at least 3 days")
- Has_temporal("asthma exacerbation", "history")
- OR("systemic corticosteroids", "depot corticosteroid injection", "emergency room attendance", "hospitalization")